下列敘述，何者錯誤？
A. 甘比亞錐蟲（Trypanosoma gambiense）只分布於東非
B. 錐鞭毛體（trypomastigote）具有波動膜（undulating membrane）
C. 甘比亞錐蟲沒有保蟲宿主
D. 非洲錐蟲症的檢查材料包括血液、淋巴液及腦脊髓液

正確答案：A. 甘比亞錐蟲（Trypanosoma gambiense）只分布於東非